Presence of cognitive disabilities

The above is a clinical trial exclusion criterion. Annotated with entity spans:
Presence of [Condition: cognitive disabilities]